Able to provide written informed consent prior to study participation. .

The above is a clinical trial inclusion criterion. Annotated with entity spans:
Able to provide [Observation: written informed consent] [Temporal: prior to study participation]. .